Clinical trial inclusion criteria:
healthy
no allergy known to these drugs
second trimester abortion

Annotated entities:
- Condition: "healthy"
- Condition: "allergy"
- Drug: "these drugs"
- Negation: "no"
- Qualifier: "second trimester"
- Condition: "abortion"